Clinical trial exclusion criterion:
8. Have met DSM V criteria for moderate to severe substance use disorder (excluding nicotine, alcohol and cannabis) in the past, or have met DSM V criteria for moderate to severe substance use disorder for cannabis or alcohol in the past 5 years.

Entity relations:
- Has_value("DSM V criteria", "met")
- Has_negation("nicotine", "excluding")
- Has_negation("alcohol", "excluding")
- Has_negation("cannabis", "excluding")
- Has_value("DSM V criteria", "met")
- AND("substance use disorder", "nicotine")
- Has_qualifier("substance use disorder", "moderate to severe")
- AND("DSM V criteria", "substance use disorder")
- Has_temporal("substance use disorder", "in the past")
- AND("substance use disorder", "cannabis")
- Has_temporal("substance use disorder", "in the past 5 years")
- Has_qualifier("substance use disorder", "moderate to severe")
- AND("DSM V criteria", "substance use disorder")
- AND("substance use disorder", "alcohol")
- AND("substance use disorder", "cannabis")
- OR("substance use disorder", "DSM V criteria")
- OR("cannabis", "alcohol")